Treatment within the past 4 days with an antibiotic that may be effective against typhoid fever

The above is a clinical trial exclusion criterion. Annotated with entity spans:
Treatment [Temporal: within the past 4 days] with an [Drug: antibiotic] that may be [Qualifier: effective against typhoid fever]